Clinical trial inclusion criterion:
2. Is being admitted to a hospital for routine vEEG monitoring related to seizures.

Annotated entities:
- Parsing_Error: "2."
- Procedure: "vEEG monitoring"
- Condition: "seizures"
- Procedure: "admitted to a hospital"